Clinical trial exclusion criterion:
Ongoing treatment with cyclosporine within 2 weeks;

Entity relations:
- Has_temporal("treatment", "Ongoing")
- AND("treatment", "cyclosporine")
- Has_temporal("treatment", "within 2 weeks")